濾泡促素（FSH）主要是由睪丸塞托萊氏細胞（Sertoli cells）所分泌的何種激素調控？
A. 抑制素（inhibin）
B. 雌激素（estrogen）
C. 睪固酮（testosterone）
D. 助孕酮（progesterone）

正確答案：A. 抑制素（inhibin）